Clinical trial inclusion criterion:
previous allergic reaction to antibiotics (bismuth, amoxicillin, metronidazole, clarithromycin, tetracycline) and PPI (esomeprazole),

Entity relations:
- Subsumes("PPI", "esomeprazole")
- Subsumes("antibiotics", "bismuth")
- AND("allergic reaction", "antibiotics")
- Has_temporal("allergic reaction", "previous")
- OR("bismuth", "clarithromycin", "metronidazole", "amoxicillin", "tetracycline")
- OR("antibiotics", "PPI")